Pulmonary disease necessitating home oxygen therapy

The above is a clinical trial exclusion criterion. Annotated with entity spans:
[Condition: Pulmonary disease] necessitating [Procedure: home oxygen therapy]